Clinical trial exclusion criterion:
WBC < 3.5/ml

Annotated entities:
- Measurement: "WBC"
- Value: "< 3.5/ml"